1. Age 18-80 years

The above is a clinical trial inclusion criterion. Annotated with entity spans:
[Parsing_Error: 1.] [Person: Age] [Value: 18-80 years]